List the endoscopic diagnoses that have been reported in children with autism

Endoscopic examinations in autistic children have been reported to show : I or II reflux esophagitis,  Achalasia, chronic gastritis and chronic duodenitis,  mild acute and chronic inflammation of the small bowel and colorectum and Ileo-colonic lymphoid nodular hyperplasia (LNH).  
The number of Paneth's cells in the duodenal crypts was found to be significantly elevated in autistic children compared with non-autistic control subjects. Low intestinal carbohydrate digestive enzyme activity was reported although there was no abnormality found in pancreatic function. Autistic children have ben reported to have an increased pancreatico-biliary fluid output after intravenous secretin administration.